Clinical trial exclusion criterion:
Severe hepatic or renal failure

Entity relations:
- Has_qualifier("hepatic failure", "Severe")
- OR("hepatic failure", "renal failure")